在同一運動強度下，腳踏車有氧運動訓練後的心肺功能與訓練前相比，下列敘述何者錯誤？
A. 心跳速率（heart rate）不變
B. 每次心搏量（stroke volume）變大
C. 攝氧量（VO2）約略不變
D. 心輸出量（cardiac output）約略不變或下降

正確答案：A. 心跳速率（heart rate）不變